Previous hyaluronic acid injection within 6 months

The above is a clinical trial exclusion criterion. Annotated with entity spans:
[Temporal: Previous] [Procedure: hyaluronic acid injection] [Temporal: within 6 months]